早產兒有呼吸窘迫症，主要是因下列何種細胞之功能異常？
A. 第一型肺泡細胞（typeⅠpneumocytes）
B. 第二型肺泡細胞（typeⅡpneumocytes）
C. 刷細胞（brush cells）
D. Clara 細胞

正確答案：B. 第二型肺泡細胞（typeⅡpneumocytes）